7. anticoagulation or immunosuppressive therapy

The above is a clinical trial exclusion criterion. Annotated with entity spans:
7. [Procedure: anticoagulation] or [Procedure: immunosuppressive therapy]